Clinical trial exclusion criterion:
Congestive heart failure, history of ventricular tachycardia, ventricular fibrillation or multifocal ventricular extrasystoles or QTc prolongation.

Entity relations:
- Has_temporal("ventricular tachycardia", "history of")
- OR("Congestive heart failure", "QTc prolongation", "ventricular fibrillation", "ventricular tachycardia", "multifocal ventricular extrasystoles")